Known hypersensitivity to paracetamol or mannitol (excipient with known effect)

The above is a clinical trial exclusion criterion. Annotated with entity spans:
Known [Condition: hypersensitivity] to [Drug: paracetamol] or [Drug: mannitol] [Non-representable: (excipient with known effect)]